Failure of medical treatment for at least 3 months.

The above is a clinical trial inclusion criterion. Annotated with entity spans:
[Observation: Failure] of [Procedure: medical treatment] [Multiplier: for at least 3 months].